Clinical trial exclusion criterion:
Psychiatric and somatoform disorders

Entity relations:
- OR("Psychiatric disorders", "somatoform disorders")